2. Antifungals: itraconazole, ketoconazole, voriconazole

The above is a clinical trial exclusion criterion. Annotated with entity spans:
[Parsing_Error: 2.] Antifungals: [Drug: itraconazole], [Drug: ketoconazole], [Drug: voriconazole]